What classes of drugs does Retapamulin belong to?

Retapamulin is a member of the pleuromutilin family of antibiotics.